Certain infectious endocarditis

The above is a clinical trial exclusion criterion. Annotated with entity spans:
[Qualifier: Certain] [Condition: infectious endocarditis]